Clinical trial exclusion criterion:
Treatment with cholestyramine or colestipol

Entity relations:
- AND("Treatment", "cholestyramine")
- OR("cholestyramine", "colestipol")